關於縱膈腔生殖細胞瘤（germ cell tumor）的敘述，下列何者錯誤？
A. teratoma最常見
B. seminoma病人的抽血檢查可見α-fetoprotein升高
C. nonseminomatous tumor病人的抽血檢查可見β-HCG 的升高
D. seminoma對放射治療比nonseminomatous tumor有效應

正確答案：B. seminoma病人的抽血檢查可見α-fetoprotein升高